Clinical trial inclusion criterion:
Referred for STEMI within 6 hours from beginning of chest pain or stable coronary artery disease requiring a loading dose of Prasugrel or Ticagrelor according to the international recommendations.

Entity relations:
- Has_multiplier("Prasugrel", "loading dose")
- Has_temporal("STEMI", "within 6 hours from beginning of chest pain")
- Has_index("within 6 hours from beginning of chest pain", "beginning of chest pain")
- Has_qualifier("coronary artery disease", "stable")
- AND("coronary artery disease", "Prasugrel")
- multi("beginning of chest pain", "chest pain")
- OR("Prasugrel", "Ticagrelor")
- OR("STEMI", "coronary artery disease")